Clinical trial exclusion criterion:
Parkinson's or other neurological disease

Entity relations:
- OR("Parkinson's", "neurological disease")